¿Qué déficit mineral especialmente se ha observado en casos de pica?
1. Déficit de calcio.
2. Déficit de cinc.
3. Déficit de plomo.
4. Déficit de potasio.
5. Déficit de sodio.

Respuesta correcta: 2. Déficit de cinc.